Type I DM

The above is a clinical trial exclusion criterion. Annotated with entity spans:
[Condition: Type I DM]